Clinical trial inclusion criteria:
1. Male and female subjects must be 18 years of age or older and ambulatory.
2. Females of child-bearing potential (FOCP) must have a negative serum beta human chorionic gonadotropin (HCG) pregnancy test.
3. A documented history of severe Symptomatic Orthostatic Hypotension (SOH) that, in the judgment of the treating physician, has required treatment with midodrine HCl , and has been at a stable dose for at least 3 months.
4. The subject has manifested at least 1 of the following symptoms while standing or had a medical history of 1 of the following when not treated for orthostatic hypotension (OH): dizziness, lightheadedness, feeling faint, or feeling like they might black out.

Annotated entities:
- Person: "Male"
- Person: "female"
- Value: "18 years or older"
- Person: "age"
- Visit: "ambulatory"
- Person: "Females"
- Condition: "child-bearing potential"
- Measurement: "serum beta human chorionic gonadotropin (HCG) pregnancy test"
- Value: "negative"
- Condition: "Symptomatic Orthostatic Hypotension (SOH)"
- Qualifier: "severe"
- Drug: "midodrine HCl"
- Qualifier: "stable dose"
- Temporal: "for at least 3 months"
- Multiplier: "at least 1"
- Condition: "dizziness"
- Condition: "lightheadedness"
- Condition: "feeling faint"
- Condition: "feeling like they might black out"
- Condition: "orthostatic hypotension (OH)"
- Procedure: "treated"
- Negation: "not"
- Multiplier: "1"